What tissue is commonly affected in Marfan's syndrome

marfan syndrome (ms) is a connective tissue disorder that affects thousands of adolescents .